Pregnancy or women currently breastfeeding.

The above is a clinical trial exclusion criterion. Annotated with entity spans:
[Condition: Pregnancy] or [Person: women] currently [Observation: breastfeeding].